我國醫療現況，下列何者正確？
A. 一般情況下，病人為未成年人或無法親自簽署手術同意書者，醫院社工人員可代為簽署
B. 若未經病患或代理人同意而實施醫療行為，可能構成法律上的責任
C. 病患簽署同意書，可免除醫療人員醫療疏失之責任
D. 醫療法第 60 條規定：「醫院、診所遇有危急病人，應先予適當之急救，並即依其人員及設備能力予以救治或採取一切必要措施，不得無故拖延。」因此醫師必須盡一切可能救治所有病人

正確答案：B. 若未經病患或代理人同意而實施醫療行為，可能構成法律上的責任